Clinical trial exclusion criterion:
Exclusion criteria controls: First degree relatives with psychiatric disease, Substance abuse during the last 3 month or positive screening of drugs in urine-sample, Head injury with more than 5 minutes of unconsciousness, Components of metal implanted by operation, Pacemaker, Pregnancy, Severe physical illness

Annotated entities:
- Observation: "controls"
- Observation: "First degree relatives"
- Condition: "psychiatric disease"
- Condition: "Substance abuse"
- Temporal: "during the last 3 month"
- Value: "positive"
- Procedure: "screening of drugs"
- Qualifier: "urine-sample"
- Condition: "Head injury"
- Multiplier: "more than 5 minutes"
- Condition: "unconsciousness"
- Device: "Components of metal"
- Device: "Pacemaker"
- Condition: "Pregnancy"
- Condition: "Severe physical illness"